Patient with "de novo" heart Failure and LVEF <= 40% admitted in hospital, without contraindications for BB prescription with cardiologist up-titration prescription and without having achieved BB target dose previous discharge and signing informed consent.

The above is a clinical trial inclusion criterion. Annotated with entity spans:
Patient with "[Qualifier: de novo]" [Condition: heart Failure] and [Measurement: LVEF] [Value: <= 40%] [Procedure: admitted] in [Visit: hospital], [Negation: without] [Condition: contraindications] for [Drug: BB] prescription with cardiologist up-titration prescription and without having achieved BB target dose previous discharge and signing informed consent.